Clinical trial inclusion criterion:
Patients receiving opioids and other concomitant pain medications should have a stable dose for the last 15 days.

Annotated entities:
- Drug: "opioids"
- Drug: "pain medications"
- Qualifier: "other"
- Qualifier: "stable dose"
- Temporal: "for the last 15 days"